Una amina, debido al par de electrones no enlazantes que posee el nitrógeno:
1. Puede ser considerada como un electrófilo.
2. Puede ser considerada como un ácido de Lewis.
3. Puede actuar como un centro de ataque de reactivos de carácter nucleofílico.
4. Puede ser considerada como un nucleófilo.
5. Es un ejemplo de producto apolar.

Respuesta correcta: 4. Puede ser considerada como un nucleófilo.